Breast-feeding women or fertile women not agreeing to use an effective method of contraception

The above is a clinical trial exclusion criterion. Annotated with entity spans:
[Condition: Breast-feeding] [Person: women] or [Condition: fertile] [Person: women] [Negation: not] [Observation: agreeing to use an effective method of contraception]